Clinical trial inclusion criterion:
Using one of the following asthma therapies prior to entry into the study: SABA inhaler alone (e.g. salbutamol) on an as required basis and/or Regular non-inhaled corticosteroid (ICS) controller medications for asthma (e.g. cromones or leukotriene receptor antagonists) and/or Previously treated with ICS (equipotent to inhaled budesonide <=400 micrograms (mcg) total daily dose). There must be no ICS use within 2 weeks of Visit 1 (Screening).

Entity relations:
- Has_index("prior to entry into the study", "entry into the study")
- Has_temporal("asthma therapies", "prior to entry into the study")
- Subsumes("SABA inhaler", "salbutamol")
- Has_value("budesonide", "<=400 micrograms (mcg)")
- Subsumes("ICS", "budesonide")
- Subsumes("asthma therapies", "SABA inhaler")
- Has_negation("ICS", "no")
- Has_index("within 2 weeks of Visit 1 (Screening)", "Visit 1 (Screening)")
- Has_temporal("ICS", "within 2 weeks of Visit 1 (Screening)")
- Subsumes("asthma therapies", "cromones")
- OR("cromones", "leukotriene receptor antagonists", "ICS")